Clinical trial inclusion criterion:
normal blood pressure or controlled hypertension;

Entity relations:
- OR("normal blood pressure", "controlled hypertension")